Clinical trial inclusion criterion:
Provision of fully informed consent prior to study specific procedures.

Annotated entities:
- Informed_consent: "Provision of fully informed consent prior to study specific procedures"